Clinical trial exclusion criterion:
Other causes of heart failure other than diastolic dysfunction, such as restrictive cardiomyopathy or infiltrative cardiomyopathy

Entity relations:
- Has_negation("diastolic dysfunction", "other than")
- AND("heart failure", "diastolic dysfunction")
- Subsumes("heart failure", "restrictive cardiomyopathy")
- OR("restrictive cardiomyopathy", "infiltrative cardiomyopathy")